Clinical trial inclusion criterion:
Patient with a history of, or presenting a new episode of atrial fibrillation (either permanent or paroxysmal).

Entity relations:
- Has_qualifier("atrial fibrillation", "new episode")